Clinical trial exclusion criterion:
Male or female < 18 and > 62 years of age

Annotated entities:
- Person: "Male"
- Person: "female"
- Value: "< 18 and > 62 years"
- Person: "age"